Clinical trial exclusion criterion:
severe cardiovascular disease, liver and kidney disease, and complications of diabetes

Annotated entities:
- Qualifier: "severe"
- Condition: "cardiovascular disease"
- Condition: "kidney disease"
- Condition: "liver disease"
- Condition: "complications"
- Condition: "diabetes"